Hace 24 horas que D. J. de 28 años, ha sido intervenido quirúrgicamente por vía abdominal. Cuando entra a la habitación le sonríe y bromea con las visitas. La presión arterial es de 130/74 mmHg, la frecuencia cardiaca de 80 y la respiratoria de 18. Le comenta que tiene dolor y en una escala numérica de intensidad del dolor de 0 (sin dolor) a 10 (el peor dolor posible), D. J. puntúa su dolor en 8. Basándose en estos datos, señale el número que elegiría usted para representar la valoración del dolor de este señor:
1. 9.
2. 8.
3. 7.
4. 6.
5. 5.

Respuesta correcta: 2. 8.